Clinical trial exclusion criterion:
Acute heart failure or during episodes of heart failure decompensation requiring intravenous inotropic therapy.

Entity relations:
- AND("heart failure decompensation", "intravenous inotropic therapy")
- OR("Acute heart failure", "heart failure decompensation")